Clinical trial exclusion criterion:
Patients with history of glucose intolerance or diabetes.

Entity relations:
- Has_temporal("glucose intolerance", "history")
- Has_temporal("diabetes", "history")
- OR("glucose intolerance", "diabetes")